Clinical trial exclusion criterion:
24. Hepatic dysfunction as defined by Child-Pugh Class B or C

Annotated entities:
- Parsing_Error: "24."
- Condition: "Hepatic dysfunction"
- Measurement: "Child-Pugh"
- Value: "Class B or C"